Clinical trial exclusion criterion:
History or onset neurological diseases;

Entity relations:
- Has_temporal("neurological diseases", "History")
- OR("History", "onset")